Clinical trial inclusion criterion:
1. HIV infection with plasma and CSF HIV RNA concentrations (using Roche Amplicor assay) > 1,000 copies/ mL (available after baseline LP).

Annotated entities:
- Condition: "HIV infection"
- Measurement: "plasma concentration"
- Measurement: "CSF HIV RNA concentration"
- Procedure: "Roche Amplicor assay"
- Value: "> 1,000 copies/ mL"